Parasitic worm infection e.g. schistosomiasis, and hook worm by stool analysis.

The above is a clinical trial exclusion criterion. Annotated with entity spans:
[Condition: Parasitic worm infection] e.g. [Condition: schistosomiasis], and [Condition: hook worm] by [Procedure: stool analysis].